allergy to eggs

The above is a clinical trial exclusion criterion. Annotated with entity spans:
[Condition: allergy] to [Drug: eggs]